Clinical trial exclusion criterion:
Subject with hypotension and a resting systolic blood pressure of < 90 mmHG or hypertension with a resting systolic blood pressure > 170 mmHG or a resting diastolic blood pressure > 110 mmHG

Annotated entities:
- Condition: "hypotension"
- Measurement: "systolic blood pressure"
- Value: "< 90 mmHG"
- Condition: "hypertension"
- Measurement: "systolic blood pressure"
- Value: "> 170 mmHG"
- Measurement: "diastolic blood pressure"
- Value: "> 110 mmHG"